Clinical trial exclusion criterion:
No Down syndrome

Annotated entities:
- Negation: "No"
- Condition: "Down syndrome"